Clinical trial inclusion criterion:
Able to participate in the full 2 years of treatment

Entity relations:
- Has_multiplier("treatment", "full 2 years")
- AND("Able to participate", "treatment")